¿De qué líquido corporal deriva directamente la linfa?
1. Del líquido intracelular.
2. Del plasma sanguíneo.
3. Del líquido intersticial.
4. Del líquido pleural.

Respuesta correcta: 3. Del líquido intersticial.